Clinical trial exclusion criterion:
Congenital or rheumatic heart diseases

Entity relations:
- Has_qualifier("heart diseases", "Congenital")
- OR("Congenital", "rheumatic")